Clinical trial exclusion criterion:
Hostility or refusal to cooperate

Annotated entities:
- Observation: "refusal to cooperate"
- Observation: "Hostility"